Clinical trial exclusion criterion:
Use of opioids or neuropathic analgesics

Annotated entities:
- Drug: "opioids"
- Drug: "neuropathic analgesics"